Ages =18 years old, < 80 years old;

The above is a clinical trial inclusion criterion. Annotated with entity spans:
[Person: Ages] [Value: =18 years old, < 80 years old];